Clinical trial inclusion criterion:
Women with POI: For the purpose of the research women is considered to have POI if she is aged less than 40 years and has amenorrhea of at least 4 month with FSH level above 25 IU/L (repeated twice >4 weeks apart).

Annotated entities:
- Person: "Women"
- Condition: "POI"
- Person: "aged"
- Value: "less than 40 years"
- Condition: "amenorrhea"
- Temporal: "at least 4 month"
- Measurement: "FSH level"
- Value: "above 25 IU/L"
- Multiplier: "repeated twice"
- Temporal: ">4 weeks apart"